下列有關腐蝕性食道傷害（caustic injury）之敘述，何者錯誤？
A. 重建消化道手術應在 3 至 6 個月完成
B. 此病人患食道癌的機會比一般人高 1000 倍
C. 一般建議開胸手術切除食道較不開胸切除食道安全
D. 胃為常用的重建食道器官

正確答案：A. 重建消化道手術應在 3 至 6 個月完成